¿Cuál de los siguientes parásitos presenta disco suctorio antero-ventral?:
1. Trichomonas vaginalis.
2. Babesia bovis.
3. Giardia intestinalis.
4. Trypanosoma cruzi.

Respuesta correcta: 3. Giardia intestinalis.